Clinical trial inclusion criterion:
Diagnosis of sleep disordered breathing or obstructive sleep apnea

Entity relations:
- OR("sleep disordered breathing", "obstructive sleep apnea")